Clinical trial inclusion criteria:
Age : from 20 to 90 y/o.
HBsAg-positive for more than 6 months and HBV DNA < 2000 IU/ml (Subgroup 1)or HBsAg-negative but anti-HBc positive with HBV DNA < 2000 IU/ml (Subgroup 2).
Inflammatory arthritis patients who plan to treat with biological agents, including Humira or Enbrel or Simponi or Orencia or Mabthera or Actemra; as first line biologic treatment is indicated.

Annotated entities:
- Person: "Age"
- Value: "20 to 90 y/o"
- Measurement: "HBsAg"
- Value: "positive"
- Temporal: "more than 6 months"
- Measurement: "HBV DNA"
- Value: "< 2000 IU/ml"
- Measurement: "HBsAg"
- Value: "negative"
- Measurement: "anti-HBc"
- Value: "positive"
- Measurement: "HBV DNA"
- Value: "< 2000 IU/ml"
- Condition: "Inflammatory arthritis"
- Procedure: "biological agents"
- Drug: "Humira"
- Drug: "Enbrel"
- Drug: "Simponi"
- Drug: "Orencia"
- Drug: "Mabthera"
- Drug: "Actemra"